Clinical trial inclusion criterion:
All subjects will have normal cognition at baseline: a Clinical Dementia Rating CDR=0, Global Deterioration Scale GDS<2.

Annotated entities:
- Condition: "normal cognition"
- Temporal: "at baseline"
- Measurement: "Clinical Dementia Rating CDR"
- Value: "=0"
- Measurement: "Global Deterioration Scale GDS"
- Value: "<2"